Clinical trial exclusion criterion:
Known allergy or contraindication (relative or absolute) to progesterone therapy.

Entity relations:
- Has_qualifier("allergy", "relative")
- AND("allergy", "progesterone therapy")
- OR("relative", "absolute")
- OR("allergy", "contraindication")